What 3 organs are the sphincter of Oddi associated with?

Sphincter of Oddi (SO) is a dynamic structure located strategically at the confluence of the bile duct, the pancreatic duct and the duodenum.